What type of enzyme is peroxiredoxin 2 (PRDX2)?

Peroxiredoxin 2 (PRDX2) is an antioxidant enzyme that uses cysteine residues to decompose peroxides. 
Peroxiredoxin-2 (PRDX2), an enzyme reducing hydrogen peroxide and lipid peroxides 
Peroxiredoxin 2 (Prx2) is a thiol-dependent peroxidase.